Clinical trial inclusion criteria:
Men or women aged 18-60 years.
Primary psychiatric diagnosis of Major Depressive Disorder, without psychotic features, confirmed via SCID-IV structured diagnostic interview.
Screening Hamilton Depression Rating Scale (HAMD) = 18; and Baseline HAMD = 15.
If the patient is a woman of child-bearing potential, she must agree to use an acceptable form of birth control for duration of study participation.
Able to understand and provide informed consent for participation.

Annotated entities:
- Person: "Men"
- Person: "women"
- Person: "aged"
- Value: "18-60 years"
- Condition: "Men or women aged 18-60 years."
- Qualifier: "Primary"
- Condition: "Major Depressive Disorder"
- Negation: "without"
- Condition: "psychotic features"
- Measurement: "Screening Hamilton Depression Rating Scale"
- Measurement: "HAMD"
- Value: "= 18"
- Measurement: "HAMD"
- Qualifier: "Baseline"
- Value: "= 15"
- Pregnancy_considerations: "If the patient is a woman of child-bearing potential, she must agree to use an acceptable form of birth control for duration of study participation"
- Informed_consent: "Able to understand and provide informed consent for participation"